Clinical trial exclusion criterion:
Person who is not wearing prosthesis 8hours/day on average.

Entity relations:
- Has_negation("prosthesis", "not")
- Has_multiplier("prosthesis", "8hours/day")